Neutrophils > 1.5 109/l, Platelets > 100 109/l, Hemoglobin > 9g/dl, Total bilirubin < 1.5 UNL, AST (SGOT) and ALT (SGPT) < 2.5 UNL, Alkaline phosphatases < 5 UNL, Creatinine < 1 UNL

The above is a clinical trial inclusion criterion. Annotated with entity spans:
[Measurement: Neutrophils] [Value: > 1.5 109/l], [Measurement: Platelets] [Value: > 100 109/l], [Measurement: Hemoglobin] [Value: > 9g/dl], [Measurement: Total bilirubin] [Value: < 1.5 UNL], [Measurement: AST (SGOT)] and [Measurement: ALT (SGPT)] [Value: < 2.5 UNL], [Measurement: Alkaline phosphatases] [Value: < 5 UNL], [Measurement: Creatinine] [Value: < 1 UNL]